Known uncontrolled systemic illness (uncontrolled diabetes, human immunodeficiency virus, vasculitis, autoimmune/inflammatory disease)

The above is a clinical trial exclusion criterion. Annotated with entity spans:
Known [Qualifier: uncontrolled] [Condition: systemic illness] ([Qualifier: uncontrolled] [Condition: diabetes], [Condition: human immunodeficiency virus], [Condition: vasculitis], [Condition: autoimmune]/[Condition: inflammatory disease])